Ongoing anaemia as indicated by haemoglobin values below the lower limit of the laboratory-specified reference range. If the finger prick method demonstrates an anaemia, no further protocol procedures will be performed, and the subject will be referred for appropriate medical management. The subject may participate in this study following therapy and evidence that the anaemia has been resolved.

The above is a clinical trial exclusion criterion. Annotated with entity spans:
[Temporal: Ongoing] [Condition: anaemia] as indicated by [Measurement: haemoglobin] values [Value: below the lower limit of the laboratory-specified reference range]. If the [Procedure: finger prick method] demonstrates an [Condition: anaemia], no further protocol procedures will be performed, [Non-representable: and the subject will be referred for appropriate medical management. The subject may participate in this study following therapy and evidence that the anaemia has been resolved.]